Subject who is pregnant or breast feeding, or planning to become pregnant during treatment and within 2 months after the discontinuation of study treatment.

The above is a clinical trial exclusion criterion. Annotated with entity spans:
Subject who is [Condition: pregnant] or [Observation: breast feeding], or [Mood: planning to] [Observation: become pregnant] [Temporal: during treatment] and [Temporal: within 2 months after the discontinuation of study treatment].